La heparina es:
1. Una proteína plasmática sin carga neta con función coagulante.
2. Un glucosaminoglucano con alta densidad de grupos sulfato en su estructura y función anticoagulante.
3. Una proteasa que facilita la trasformación de protrombina en trombina.
4. Una proteína de la matriz extracelular sin carga neta, que da lugar a soluciones muy viscosas con función lubricante.
5. Un homopolisacárido con función anticoagulante gracias a la alta densidad de cargas positivas en su estructura.

Respuesta correcta: 2. Un glucosaminoglucano con alta densidad de grupos sulfato en su estructura y función anticoagulante.